有關神經性膀胱症的評估，下列敘述何者錯誤？
A. 詳細病史詢問與身體診查仍為最重要的評估項目
B. 尿路動力學檢查主要用於評估膀胱肌肉強度與收縮時程
C. 解尿膀胱尿道攝影主要在檢查解尿時的解剖構造異常
D. 一般並不需要腎臟超音波檢查

正確答案：D. 一般並不需要腎臟超音波檢查